Administration of immunoglobulins and/or any blood products within the three months preceding the first vaccination or during the study.

The above is a clinical trial exclusion criterion. Annotated with entity spans:
Administration of [Drug: immunoglobulins] and/or [Drug: any blood products] [Temporal: within the three months preceding the first vaccination] or [Temporal: during the study].